一位 57 歲女性因為半年來斷斷續續在性生活後有陰道點狀出血現象求診，生產史為 G3P2，51 歲停經，過去並沒有使用荷爾蒙。此次求診 2 星期前在當地診所抺片檢查發現有異常報告：atypical squamous cell，請問醫師下一步如何安排處置較為恰當？
A. 電腦斷層檢查
B. 婦科超音波檢查
C. 陰道鏡檢查
D. 再做一次抺片檢查

正確答案：C. 陰道鏡檢查